2. Screening tools: MRI safety screening questionnaire, Medical history, Medical Assessments: Urine toxicology analyzes for presence of a broad range of prescription and nonprescription drugs.

The above is a clinical trial exclusion criterion. Annotated with entity spans:
[Parsing_Error: 2.] [Procedure: Screening] tools: [Procedure: MRI safety screening questionnaire], [Procedure: Medical history], Medical Assessments: [Procedure: Urine toxicology analyzes] for presence of a broad range of [Qualifier: prescription] and [Qualifier: nonprescription] [Drug: drugs].